Subjects were to, in the opinion of the investigator, have no clinically significant abnormal findings of renal and hepatic function as determined by serum creatinine, total bilirubin, and transaminase levels.

The above is a clinical trial inclusion criterion. Annotated with entity spans:
Subjects were to, [Subjective_judgement: in the opinion of the investigator], have [Negation: no] [Qualifier: clinically significant] [Condition: abnormal findings] of [Measurement: renal] and [Measurement: hepatic function] as determined by [Measurement: serum creatinine], [Measurement: total bilirubin], and [Measurement: transaminase levels].